Clinical trial inclusion criterion:
older than 18 years (of both sexes)

Annotated entities:
- Person: "years"
- Value: "older than 18"
- Person: "both sexes"